Clinical trial inclusion criterion:
(2)Exhibited good tolerance to enalapril and good overall medication compliance (>80%) in run-in period or previously exhibited good tolerance and adherence to ACEI drugs in previous medication history.

Annotated entities:
- Condition: "good tolerance to enalapril"
- Drug: "enalapril"
- Measurement: "overall medication compliance"
- Value: "good"
- Value: ">80%"
- Temporal: "previously"
- Condition: "good tolerance to ACEI drugs"
- Drug: "ACEI drugs"
- Observation: "good adherence to ACEI drugs"
- Temporal: "medication history"